有關男性生殖系統，下列敘述何項錯誤？
A. 輸精管（ductus deferens）的上皮是偽複層柱狀上皮（pseudostratified columnar epithelium）
B. 黃體刺激素（LH）會刺激萊氏細胞（Leydig cell）產生雄性素（testosterone）
C. 輸精管（ductus deferens）具有內層縱走，中層環走，外層縱走之三層平滑肌管壁
D. Sertoli 細胞所分泌之抑制素（inhibin）可促進腦下垂體前葉黃體刺激素（LH）之釋放

正確答案：D. Sertoli 細胞所分泌之抑制素（inhibin）可促進腦下垂體前葉黃體刺激素（LH）之釋放